Clinical trial exclusion criterion:
Previous exposure to cytotoxic drugs or pelvic irradiation.

Annotated entities:
- Drug: "cytotoxic drugs"
- Procedure: "pelvic irradiation"